Clinical trial inclusion criterion:
Severe hyperchloraemia

Entity relations:
- Has_qualifier("hyperchloraemia", "Severe")